Able and willing to sign an informed consent.

The above is a clinical trial inclusion criterion. Annotated with entity spans:
[Post-eligibility: Able and willing to sign an informed consent.]